What does the human IVIG treatment for Alzheimer's disease contain?

Human intravenous immunoglobulin (IVIG) is a mixture of polyclonal IgG antibodies isolated and pooled from thousands of healthy human donors.